相較於紅肌，有關白肌之敘述，下列何者正確？
A. 收縮速率較慢
B. 較慢產生疲勞
C. 肌纖維直徑較小
D. 粒線體含量較少

正確答案：D. 粒線體含量較少